Clinical trial inclusion criterion:
1) age 50-70

Annotated entities:
- Person: "age"
- Value: "50-70"
- Parsing_Error: "1)"